Clinical trial inclusion criterion:
Leukocytosis (>10.000 cells/mm3), leftward shift (>10%) or leucopenia (<4000 cells/mm3)

Annotated entities:
- Condition: "Leukocytosis"
- Multiplier: ">10.000 cells/mm3"
- Condition: "leucopenia"
- Multiplier: "<4000 cells/mm3"
- Multiplier: "leftward shift >10%"